Clinical trial inclusion criteria:
Men between 45 and 80 years age
Participants with low serum testosterone concentrations (< 300 ng/dL) who exhibit at least one sign or symptom of hypogonadism and have evidence of cardiovascular (CV) disease or are at an increased risk for CV disease.

Annotated entities:
- Person: "Men"
- Value: "between 45 and 80 years"
- Person: "age"
- Measurement: "serum testosterone concentrations"
- Value: "low"
- Value: "< 300 ng/dL"
- Multiplier: "at least one"
- Condition: "sign"
- Condition: "symptom"
- Condition: "hypogonadism"
- Mood: "evidence of"
- Condition: "cardiovascular (CV) disease"
- Mood: "increased risk"
- Condition: "CV disease"